Clinical trial exclusion criterion:
Type 2 diabetes (HbA1c>6.5) or type 1 diabetes

Entity relations:
- AND("Type 2 diabetes", "HbA1c")
- Has_value("HbA1c", ">6.5")
- OR("Type 2 diabetes", "type 1 diabetes")